下列何種功能與mesolimbic dopamine pathway最有關？
A. perception of fear
B. primary visual perception
C. body balance
D. motivation and reward behaviors

正確答案：D. motivation and reward behaviors